diabetes type 1 with complications

The above is a clinical trial exclusion criterion. Annotated with entity spans:
[Condition: diabetes type 1] with [Condition: complications]